Clinical trial exclusion criterion:
HIV positive

Annotated entities:
- Condition: "HIV positive"